2. Patients in the acute phase of severe hepatitis

The above is a clinical trial exclusion criterion. Annotated with entity spans:
2. Patients in the [Qualifier: acute phase] of [Condition: severe hepatitis]